Clinical trial exclusion criterion:
Active syphilis or treatment for syphilis within 90 days prior to study entry. NOTE: Active syphilis is defined as four-fold increase in serum rapid plasma reagin (RPR) or venereal disease research laboratory (VDRL) tests in an individual with past syphilis, or newly reactive serum RPR or VDRL with a reactive confirmatory test (enzyme immunoassays [EIA] or chemiluminescent assay [CIA], T. pallidum particle agglutination [TP-PA], or fluorescent treponemal antibody absorbed [FTA-ABS]).

Entity relations:
- AND("treatment", "syphilis")
- Has_temporal("syphilis", "Active")
- Has_temporal("treatment", "within 90 days prior to study entry")
- Has_index("within 90 days prior to study entry", "study entry")
- Has_temporal("syphilis", "Active")
- Has_temporal("syphilis", "past")
- Subsumes("reactive confirmatory test", "enzyme immunoassays [EIA]")
- Has_temporal("reactive", "newly")
- Has_value("serum RPR", "reactive")
- Has_value("serum rapid plasma reagin (RPR)", "four-fold increase")
- Subsumes("syphilis", "serum rapid plasma reagin (RPR)")
- Subsumes("syphilis", "serum RPR")
- Subsumes("syphilis", "syphilis")
- OR("syphilis", "treatment")
- OR("enzyme immunoassays [EIA]", "T. pallidum particle agglutination [TP-PA]", "chemiluminescent assay [CIA]", "fluorescent treponemal antibody absorbed [FTA-ABS]")
- OR("serum RPR", "VDRL")
- OR("serum rapid plasma reagin (RPR)", "venereal disease research laboratory (VDRL)")
- OR("syphilis", "reactive confirmatory test")